Other Medications: Participants who are taking other medications on a routine basis must be on a stable dose for at least 4 weeks prior to the Preliminary Screening Period (P1), and must intend to continue the medication at the same regimen for the duration of the trial unless lack of efficacy, safety, or tolerability dictates otherwise. The following medications are not excluded:

The above is a clinical trial exclusion criterion. Annotated with entity spans:
Other Medications: Participants who are taking [Qualifier: other] [Drug: medications] [Multiplier: on a routine basis] must be on a [Qualifier: stable dose] [Temporal: for at least 4 weeks prior to the Preliminary Screening Period (P1)], and must intend to continue the medication at the same regimen for the duration of the trial unless lack of efficacy, safety, or tolerability dictates otherwise. [Non-representable: The following medications are not excluded:]